Clinical trial exclusion criterion:
Chronic Pulmonary Condition other than asthma

Annotated entities:
- Condition: "Chronic Pulmonary Condition"
- Condition: "asthma"
- Negation: "other"